下列關於克式循環（Krebs cycle，亦稱citric acid cycle或TCA cycle）的敘述，何者正確？
A. 在克式循環過程中，oxaloacetate淨消耗（net consumption）為零
B. 在克式循環過程中，不涉及受質階層磷酸化（substrate-level phosphorylation）
C. 一次的克式循環會產生一個分子的二氧化碳
D. 一次的克式循環會產生四個分子的FADH2

正確答案：A. 在克式循環過程中，oxaloacetate淨消耗（net consumption）為零